Clinical trial exclusion criterion:
Treatment with glucocorticoids

Annotated entities:
- Drug: "glucocorticoids"
- Procedure: "Treatment"